16. Neuropsychiatric disorders/symptoms or psychological conditions.

The above is a clinical trial exclusion criterion. Annotated with entity spans:
[Parsing_Error: 16.] [Condition: Neuropsychiatric disorders]/symptoms or [Condition: psychological conditions].